Clinical trial inclusion criteria:
The patient or his/her representative must have given free and informed consent and signed the consent
The patient must be insured or beneficiary of a health insurance plan
The patient is available for 12 months of follow-up
The patient underwent a successful transcutaneous implant procedure for an aortic valve within the past 24 hours
The patient was receiving anti-vitamin K (AVK) treatment before percutaneous implantation of the aortic valve

Annotated entities:
- Informed_consent: "The patient or his/her representative must have given free and informed consent and signed the consent"
- Non-query-able: "The patient must be insured or beneficiary of a health insurance plan"
- Post-eligibility: "The patient is available for 12 months of follow-up"
- Procedure: "transcutaneous implant procedure"
- Device: "aortic valve"
- Temporal: "past 24 hours"
- Drug: "anti-vitamin K"
- Drug: "AVK"
- Temporal: "before percutaneous implantation of the aortic valve"
- Reference_point: "percutaneous implantation of the aortic valve"